Clinical trial inclusion criterion:
CHB patients who had received single NAs for more than 12 months.

Annotated entities:
- Drug: "NAs"
- Qualifier: "single"
- Condition: "CHB"
- Temporal: "more than 12 months"